Clinical trial exclusion criterion:
History of MI, angina or congestive heart failure.

Annotated entities:
- Condition: "MI"
- Condition: "angina"
- Condition: "congestive heart failure"
- Temporal: "History"